Clinical trial inclusion criterion:
choroidal neovascularization caused by age-related macula degeneration

Entity relations:
- Has_qualifier("macula degeneration", "age-related")
- causal("choroidal neovascularization", "macula degeneration")